下列何者位於粒線體的外膜（outer mitochondrial membrane）？
A. acyl CoA synthetase
B. cytochrome c
C. nucleotide kinase
D. glycerol 3-phosphate dehydrogenase

正確答案：A. acyl CoA synthetase